30歲女性，懷孕20週，因疑似破水被緊急送到產房，生命徵象穩定，沒有發燒。超音波檢查發現胎兒心跳約每分鐘120下，胎位為頭位，但羊水指數（AFI: amnionic fluid index）為0，內診時，發現子宮頸已擴張為3公分，且已明顯變薄，並持續有羊水流出，但沒有出血的情形。最可能的診斷為：
A. 前置胎盤
B. 胎盤早期剝離
C. 子宮頸閉鎖不全
D. 絨毛膜羊膜炎（chorioamnionitis）

正確答案：C. 子宮頸閉鎖不全